Clinical trial exclusion criterion:
other conditions that may affect the evaluation of the trail

Annotated entities:
- Non-query-able: "other conditions that may affect the evaluation of the trail"